水腫患者若使用 aminoglycosides 作感染的治療時，則不宜使用下列何種利尿劑來治療水腫？
A. chlorothiazide
B. acetazolamide
C. furosemide
D. indapamide

正確答案：C. furosemide